Clinical trial inclusion criterion:
Systolic blood pressure >/= 90 mmHg

Annotated entities:
- Measurement: "Systolic blood pressure"
- Value: ">/= 90 mmHg"